Clinical trial exclusion criterion:
Imminent child's birth defined as cervix dilatation up to 7 centimeters

Entity relations:
- Has_value("cervix dilatation", "7 centimeters")
- AND("Imminent child's birth", "cervix dilatation")